Clinically significant abnormal laboratory finding

The above is a clinical trial exclusion criterion. Annotated with entity spans:
[Non-query-able: Clinically significant abnormal laboratory finding]